下列有關革蘭染色法的敘述，何者正確？
A. 初染使用結晶紫染液（crystal violet），著色後不易褪色之細菌為陽性菌
B. 初染使用沙黃染液（safranin），著色後不易褪色之細菌為陽性菌
C. 初染使用結晶紫染液，不著色之細菌為陽性菌
D. 初染使用沙黃染液，不著色之細菌為陽性菌

正確答案：A. 初染使用結晶紫染液（crystal violet），著色後不易褪色之細菌為陽性菌